Patient is currently benefiting from the treatment with nilotinib, as determined by the investigator

The above is a clinical trial inclusion criterion. Annotated with entity spans:
Patient is [Temporal: currently] benefiting from the [Procedure: treatment] with [Drug: nilotinib], [Non-representable: as determined by the investigator]